Clinical trial inclusion criterion:
10 = Beck Depression Inventory (BDI) <30 points

Entity relations:
- Has_value("Beck Depression Inventory (BDI)", "<30 points")